Clinical trial exclusion criterion:
Severe coagulopathy

Annotated entities:
- Qualifier: "Severe"
- Condition: "coagulopathy"